Clinical trial exclusion criterion:
Current use of other GLP-1A, dipeptidyl peptidase 4 (DPP4) or Sodium Glucose transporters 2 (SGLT2) inhibitors, thiazolidinediones (TZDs), pramlintide and fixed prandial insulin.

Entity relations:
- Has_qualifier("GLP-1A", "other")
- OR("GLP-1A", "prandial insulin", "thiazolidinediones (TZDs)", "dipeptidyl peptidase 4 (DPP4) inhibitors", "Sodium Glucose transporters 2 (SGLT2) inhibitors", "pramlintide")